18. Subject participated in any other clinical trial within the previous three months;

The above is a clinical trial exclusion criterion. Annotated with entity spans:
18. [Context_Error: Subject participated in any other clinical trial within the previous three months;]